A una forma extrema de agnosia caracterizada por la incapacidad para reconocer caras familiares, de le denomina:
1. Caragnosia.
2. Paragnosia.
3. Anosagnosia.
4. Prosopagnosia.

Respuesta correcta: 4. Prosopagnosia.